Clinical trial inclusion criterion:
have CAC between 10 to <1000, and

Entity relations:
- Has_value("CAC", "between 10 to <1000")